Clinical trial exclusion criterion:
Hemodynamic or respiratory instability requiring inotropic support, mechanical ventilation or mechanical heart assistance within 30 days of screening evaluation.

Annotated entities:
- Condition: "respiratory instability"
- Procedure: "inotropic support"
- Condition: "Hemodynamic instability"
- Procedure: "mechanical ventilation"
- Procedure: "mechanical heart assistance"
- Temporal: "within 30 days of screening evaluation"
- Reference_point: "screening evaluation"